Clinical trial exclusion criterion:
Weight <50 kg

Annotated entities:
- Person: "Weight"
- Value: "<50 kg"